18. Prior treatment with B cell or lymphocyte-depleting agents (eg, rituximab, Campath)

The above is a clinical trial exclusion criterion. Annotated with entity spans:
[Parsing_Error: 18.] [Temporal: Prior] treatment with [Drug: B cell] or [Drug: lymphocyte-depleting agents] (eg, [Drug: rituximab], [Drug: Campath])